Unable to make appointments (every three to six months over 2 years).

The above is a clinical trial exclusion criterion. Annotated with entity spans:
[Post-eligibility: Unable to make appointments (every three to six months over 2 years).]